What is the association between number of pregnancies and rheumatoid arthritis

Greater parity significantly reduced the odds of RA. A larger number of pregnancies and late menopause show a protective effect, delaying the onset of the disease.